Clinical trial exclusion criterion:
12. Severe hypertension with systolic >200 mmHg and diastolic >110 mmHg at rest;

Annotated entities:
- Parsing_Error: "12."
- Condition: "Severe hypertension"
- Measurement: "systolic"
- Value: ">200 mmHg"
- Measurement: "diastolic"
- Value: ">110 mmHg"